Clinical trial inclusion criterion:
Male or female 18 years or older

Annotated entities:
- Person: "Male"
- Person: "female"
- Value: "18 years or older"
- Person: "years or older"